age > 80 years

The above is a clinical trial exclusion criterion. Annotated with entity spans:
[Person: age] [Value: > 80 years]